Clinical trial exclusion criterion:
patients who have drugs contraindications

Annotated entities:
- Drug: "drugs"
- Condition: "contraindications"